El antiviral tamiflu que se utiliza contra el virus de la gripe aviar actúa:
1. Inhibiendo la neuraminidasa viral.
2. Inactivando la proteasa viral responsable del procesamiento de los precursores de los capsómeros.
3. Impidiendo la decapsidación de las partículas víricas.
4. Bloqueando la interacción de las partículas víricas con su receptor celular.
5. Alterando la actividad de la DNA polimerasa viral.

Respuesta correcta: 1. Inhibiendo la neuraminidasa viral.